Clinical trial exclusion criteria:
The use of weight-lowering drugs, any investigational blood-glucose or lipid-lowering agent (other than statins or ezetimibe) within the past 3 months
Previous treatment with systemic corticosteroids or a change in dosage of thyroid hormones in the previous 6 weeks
The use of insulin within the 3 months prior to screening
Others

Annotated entities:
- Qualifier: "weight-lowering"
- Drug: "drugs"
- Qualifier: "investigational"
- Qualifier: "lipid-lowering"
- Qualifier: "blood-glucose"
- Drug: "agent"
- Temporal: "past 3 months"
- Negation: "other"
- Drug: "statins"
- Drug: "ezetimibe"
- Drug: "systemic corticosteroids"
- Drug: "thyroid hormones"
- Qualifier: "change in dosage"
- Temporal: "previous 6 weeks"
- Drug: "insulin"
- Temporal: "within the 3 months prior to screening"
- Reference_point: "screening"
- Non-query-able: "Others"